65 歲男性，因腰椎疼痛求診，經影像學檢查及切片後，取出之腰椎組織染甲狀腺球蛋白（thyroglobulin）呈現陽性，進一步應先如何處理最適當？
A. 做放射性碘治療
B. 做腰椎之外部電療
C. 做甲狀腺全切除術
D. 做血液甲狀腺球蛋白測定

正確答案：C. 做甲狀腺全切除術